Clinical trial exclusion criterion:
History of delirium within the prior 3 months, epilepsy, stroke, dementia, psychotic disorder, or bipolar disorder

Annotated entities:
- Condition: "delirium"
- Temporal: "within the prior 3 months"
- Condition: "epilepsy"
- Condition: "stroke"
- Condition: "dementia"
- Condition: "psychotic disorder"
- Condition: "bipolar disorder"